Previous vaginal delivery.

The above is a clinical trial exclusion criterion. Annotated with entity spans:
[Temporal: Previous] [Procedure: vaginal delivery].